Clinical trial exclusion criterion:
History of other significant skin disease, or skin manifestations of allergic illness or other dermatologic condition, except chronic moderate or severe atopic dermatitis, that would interfere with the trial assessments or compromise the patient's safety according to the opinion of the Investigator

Annotated entities:
- Condition: "skin disease"
- Qualifier: "significant"
- Temporal: "History"
- Condition: "allergic illness"
- Condition: "dermatologic condition"
- Condition: "skin manifestations"
- Condition: "atopic dermatitis"
- Qualifier: "severe"
- Qualifier: "chronic moderate"
- Subjective_judgement: "would interfere with the trial assessments or compromise the patient's safety according to the opinion of the Investigator"
- Negation: "except"